Clinical trial inclusion criterion:
Endoscopic Mayo subscore >0

Entity relations:
- Has_value("Endoscopic Mayo subscore", ">0")